Clinical trial inclusion criterion:
symptomatic Dupuytrens contracture with palpable cord, involving MCP, total contracture size over 30 degrees

Annotated entities:
- Condition: "Dupuytrens contracture"
- Qualifier: "symptomatic"
- Condition: "palpable cord"
- Qualifier: "involving MCP"
- Measurement: "total contracture size"
- Value: "over 30 degrees"